Clinical trial inclusion criterion:
Age >/= 18 years

Annotated entities:
- Person: "Age"
- Value: ">/= 18 years"